Clinical trial exclusion criterion:
Psychiatric and somatoform disorders

Annotated entities:
- Condition: "Psychiatric disorders"
- Condition: "somatoform disorders"